Clinical trial exclusion criterion:
Breast feeding or pregnancy

Annotated entities:
- Condition: "pregnancy"
- Observation: "Breast feeding"